Clinical trial inclusion criterion:
IDU with report of using previously used or shared needles in past 6 months or has been in a methadone, buprenorphine, or suboxone treatment program in past 6 months or engaging in high-risk sexual behaviors

Annotated entities:
- Observation: "using previously used or shared needles"
- Temporal: "in past 6 months"
- Drug: "methadone"
- Drug: "buprenorphine"
- Drug: "suboxone"
- Procedure: "treatment program"
- Temporal: "in past 6 months"
- Observation: "engaging in high-risk sexual behaviors"
- Person: "IDU"